Clinical trial inclusion criterion:
NYHA II : Slight limitation of physical activity. Comfortable at rest, but ordinary physical activity results in undue breathlessness, fatigue or palpitation.

Annotated entities:
- Non-query-able: "NYHA II : Slight limitation of physical activity. Comfortable at rest, but ordinary physical activity results in undue breathlessness, fatigue or palpitation"